一位 24 歲女性出現輕微黃疸，驗血發現 Hb 6.8 g/dL，MCV 110 fL，Platelet 54,000/μL，reticulocyte  8%。下列何種疾病較不可能？
A. 伊凡氏症候群（Evan's syndrome）
B. 維生素B12B 缺乏（vitamin B12 deficiency）
C. 血栓性血小板缺乏紫斑症（thrombotic thrombocytopenic purpura）
D. 全身性紅斑性狼瘡（systemic lupus erythematosus）

正確答案：B. 維生素B12B 缺乏（vitamin B12 deficiency）